Clinical trial exclusion criteria:
congenital or acquired bleeding tendency
platelet count <50,000/ µL
hypersensitivity to shrimps, lobsters or beetles

Annotated entities:
- Qualifier: "acquired"
- Qualifier: "congenital"
- Condition: "bleeding tendency"
- Measurement: "platelet count"
- Value: "<50,000/ µL"
- Condition: "hypersensitivity"
- Qualifier: "shrimps"
- Qualifier: "lobsters"
- Qualifier: "beetles"